Clinical trial inclusion criterion:
Adults patients aged 18 to 85 years

Entity relations:
- Has_value("aged", "18 to 85 years")